Una de las siguientes hormonas inhibe la lipolisis:
1. Hormona del crecimiento (HGH).
2. Insulina.
3. Hormona adrenocorticotropa (ACTH).
4. Hormona estimulante del tiroides (TSH).
5. Glucagón.

Respuesta correcta: 2. Insulina.